A un paciente portador de una fístula arteriovenosa interna en el brazo izquierdo le recomendará:
1. Colocarse un vendaje compresivo para su protección.
2. Realizar ejercicios de flexión y extensión del codo para activar su maduración.
3. Palpar la fístula diariamente para comprobar que funciona.
4. Limpiar la piel circundante con un antiséptico todos los días.
5. Levantar peso con esa mano para lograr la remodelación vascular.

Respuesta correcta: 3. Palpar la fístula diariamente para comprobar que funciona.